一位 16 歲女生，由媽媽陪同至婦產科門診求診，主訴該病患於出生後 40 天因車禍外傷，經腦部手術後仍出現輕度智力障礙及肢體障礙情況。病患曾因遭性侵而接受流產手術，且月經來潮無法自理經期，長期缺乏個人衛生，媽媽請求施予子宮切除手術。請問醫師可不可以施行手術？
A. 可。因符合病人的最大利益
B. 可。因智障者，父母可代理決定
C. 不可。因侵犯性過大，且不符合病人的最大利益
D. 不可。因病人不會簽同意書

正確答案：C. 不可。因侵犯性過大，且不符合病人的最大利益